How is OCT3 associated with serotonin?

OCT3 plays a role in serotonin clearance